Clinical trial exclusion criterion:
history of drug use or alcool abuse in the last 12 months

Annotated entities:
- Condition: "alcool abuse"
- Condition: "drug use"
- Temporal: "last 12 months"